Clinical trial exclusion criterion:
Abnormalities of laboratory values: alanine-aminotransferase (ALAT), aspartate-aminotransferase (ASAT), gamma-glutamyl transferase (gammaGT), alkalic phosphatase (AP), bilirubin, amylase, lipase, cystatin C, creatinine, white blood cell count, haemoglobin, platelet count, prothrombin time, aPTT, fibrinogen, thrombin time, factors II,V,VII and X

Annotated entities:
- Measurement: "alanine-aminotransferase"
- Measurement: "ALAT"
- Measurement: "aspartate-aminotransferase"
- Measurement: "ASAT"
- Measurement: "gamma-glutamyl transferase"
- Measurement: "gammaGT"
- Measurement: "alkalic phosphatase"
- Measurement: "AP"
- Measurement: "bilirubin"
- Measurement: "amylase"
- Measurement: "lipase"
- Measurement: "cystatin C"
- Measurement: "creatinine"
- Measurement: "white blood cell count"
- Measurement: "haemoglobin"
- Measurement: "platelet count"
- Measurement: "prothrombin time,"
- Measurement: "aPTT"
- Measurement: "fibrinogen"
- Measurement: "thrombin time"
- Measurement: "factors II"
- Measurement: "factors V"
- Measurement: "factors VII"
- Measurement: "factors X"
- Value: "Abnormalities"